Clinical trial exclusion criterion:
Children who are uncooperative and difficult to manage, have major systemic diseases, or are on long-term medication will be excluded.

Entity relations:
- Has_qualifier("systemic diseases", "major")
- Has_temporal("medication", "long-term")
- OR("uncooperative", "medication", "systemic diseases")
- OR("difficult to manage", "medication", "systemic diseases")